Clinical trial exclusion criterion:
Use of inhaled or topical steroids are not an exclusion criteria.

Annotated entities:
- Drug: "inhaled steroids"
- Drug: "topical steroids"
- Negation: "not"
- Non-representable: "Use of inhaled or topical steroids are not an exclusion criteria."